16歲就讀於高中2年級的謝同學，長期午休都趴在桌上睡覺，近2星期他覺得左前臂及手掌麻麻的，尤其是左小指麻木感更加厲害，這兩天甚至拿筆寫	都覺得不靈活，因此他到門診求助。你認為這位謝同學，最可能的診斷是什麼？
A. 腕隧道症候群（carpal tunnel syndrome）
B. 尺骨神經（ulnar nerve）病變
C. 橈骨神經（radial nerve）病變
D. 臂神經叢（brachial plexus）病變

正確答案：B. 尺骨神經（ulnar nerve）病變